Mental disorders preventing the subject to understand the project description.

The above is a clinical trial exclusion criterion. Annotated with entity spans:
[Condition: Mental disorders] [Qualifier: preventing the subject to understand the project description].